Clinical trial inclusion criterion:
croup children between 6 month and 5 years old

Annotated entities:
- Value: "between 6 month and 5 years"
- Person: "old"
- Person: "children"